Patients with history of bowel obstruction, perforation.

The above is a clinical trial exclusion criterion. Annotated with entity spans:
Patients with [Temporal: history] of [Condition: bowel obstruction], perforation.